Clinical trial exclusion criterion:
Children with systemic illness that contraindicated vital pulp treatment such a sickle cell disease

Entity relations:
- AND("contraindicated", "vital pulp treatment")
- AND("systemic illness", "contraindicated")
- Subsumes("systemic illness", "sickle cell disease")